Clinical trial exclusion criterion:
Those subjects with previous use of vitamin D.

Entity relations:
- Has_temporal("vitamin D", "previous use")